Clinical trial inclusion criterion:
Patient with a history of, or presenting a new episode of atrial fibrillation (either permanent or paroxysmal).

Annotated entities:
- Condition: "atrial fibrillation"
- Qualifier: "new episode"